ASA Class I and II, eligible for endoscopic or surgical treatment with curative intent,

The above is a clinical trial inclusion criterion. Annotated with entity spans:
[Measurement: ASA Class] [Value: I] and [Value: II], [Mood: eligible for] endoscopic or [Procedure: surgical treatment] [Qualifier: with curative intent],